Males and females aged 18-40 years of age at the time of vaccination in good health as determined by medical history, physical exam, laboratory assessments and the clinical judgment of the Principal Investigator

The above is a clinical trial inclusion criterion. Annotated with entity spans:
[Person: Males] and [Person: females] [Person: aged] [Value: 18-40 years] of [Person: age] [Temporal: at the time of vaccination] in [Condition: good health] as determined by [Temporal: medical history], [Procedure: physical exam], [Procedure: laboratory assessments] and [Subjective_judgement: the clinical judgment of the Principal Investigator]